Clinical trial exclusion criterion:
Unable to self-care or mental disease without caregiver.

Entity relations:
- Has_qualifier("mental disease", "without caregiver")
- OR("Unable to self-care", "mental disease")